下列那一組織的產物對於精液（semen）組成的成分貢獻最小？
A. seminal vesicle
B. prostate gland
C. bulbourethral gland
D. urethra

正確答案：D. urethra